Substance abuse.

The above is a clinical trial exclusion criterion. Annotated with entity spans:
[Condition: Substance abuse].